Clinical trial inclusion criterion:
Serum bilirubin ≤1.5 x upper limit of normal (ULN).

Annotated entities:
- Measurement: "Serum bilirubin"
- Value: "≤1.5 x upper limit of normal (ULN)"